What was fingolimod synthesized from?

FTY720 (fingolimod, Gilenya®) was synthesized from myriocin, one of the metabolites of the fungus Isaria sinclairii known from traditional Chinese medicine for its antibacterial and energy boosting effect.